Current active dental problems including infection of the teeth or jawbone (maxilla or mandibular); dental or fixture trauma, or a current or prior diagnosis of osteonecrosis of the jaw (ONJ), of exposed bone in the mouth, or of slow healing after dental procedures.

The above is a clinical trial exclusion criterion. Annotated with entity spans:
[Temporal: Current] active [Condition: dental problems] including [Condition: infection of the teeth] or jawbone (maxilla or mandibular); [Condition: dental] or [Condition: fixture trauma], or a [Temporal: current] or [Temporal: prior] diagnosis of [Condition: osteonecrosis of the jaw (ONJ)], of [Condition: exposed bone in the mouth], or of [Condition: slow healing after dental procedures].